18. A psychiatric condition (e.g., suicidal ideation) or chronic alcohol or drug abuse problem, determined from the patient's medical history, which, in the opinion of the investigator, may pose a threat to patient compliance

The above is a clinical trial exclusion criterion. Annotated with entity spans:
[Parsing_Error: 18.] A [Condition: psychiatric condition] (e.g., [Condition: suicidal ideation]) or chronic [Condition: alcohol] or [Condition: drug abuse problem], determined from the patient's medical history, which, [Subjective_judgement: in the opinion of the investigator], [Qualifier: may pose a threat to patient compliance]